How are immediate early genes (IEG) defined?

Immediate-early (IE) genes are the first class of viral genes expressed after primary infection or reactivation. this class of genes is experimentally defined by their transcription following primary infection or reactivation in the presence of inhibitors of protein synthesis. . . .